Subjective visual loss > 6 weeks, interpreted as onset of active disease;

The above is a clinical trial inclusion criterion. Annotated with entity spans:
[Condition: Subjective visual loss] [Temporal: > 6 weeks], [Non-representable: interpreted as onset of active disease;]